Clinical trial exclusion criterion:
Severe mitral regurgitation (Regurgitant volume = 60 mL/beat, Regurgitant fraction = 50%, and/or Effective regurgitant orifice area = 0.40cm2)

Annotated entities:
- Condition: "mitral regurgitation"
- Qualifier: "Severe"
- Measurement: "Regurgitant volume"
- Value: "= 60 mL/beat"
- Measurement: "Regurgitant fraction"
- Value: "= 50%"
- Measurement: "Effective regurgitant orifice area"
- Value: "= 0.40cm2"